Current use of tobacco products;

The above is a clinical trial exclusion criterion. Annotated with entity spans:
[Temporal: Current] [Observation: use of tobacco products];